Clinical trial inclusion criterion:
Body mass index (BMI) 18 to 30 kg/m2 inclusive

Entity relations:
- Has_value("Body mass index (BMI)", "18 to 30 kg/m2 inclusive")